Hombre de 35 años de edad sufre una quemadura eléctrica de alto voltaje (3000 voltios) por contacto directo con cable con su mano izquierda. Al ingreso presenta contractura en flexión de la mano, palidez de los dedos y ausencia de pulso radial y cubital a la palpación. ¿Cuál es la medida invasiva de urgencia a realizar?
1. Bloqueo axilar con catéter.
2. Escarotomía descompresiva.
3. Monitorización de presión intracompartimental.
4. Escarectomía.

Respuesta correcta: 2. Escarotomía descompresiva.